history of neck surgery or radiotherapy;

The above is a clinical trial exclusion criterion. Annotated with entity spans:
[Temporal: history] of [Procedure: neck surgery] or [Procedure: radiotherapy];